Clinical trial exclusion criterion:
SpO2 < 90 %

Annotated entities:
- Measurement: "SpO2"
- Value: "< 90 %"